造成酒癮之因素不包括下列何項？
A. 環境
B. 學習
C. 遺傳
D. 倫理

正確答案：D. 倫理